Clinical trial exclusion criterion:
Any diagnosis requiring anti-coagulation

Annotated entities:
- Drug: "anti-coagulation"